Clinical trial exclusion criterion:
Prior treatment with topotecan or gemcitabine.

Entity relations:
- AND("treatment", "topotecan")
- Has_temporal("treatment", "Prior")
- OR("topotecan", "gemcitabine")